Tras un parto normal a término se observa que el bebé tiene un latido cardíaco de 130 latidos por minuto, respira con armonía y tranquilidad, tiene movimientos espontáneos, color sonrosado y buena respuesta al estímulo de succión. ¿Qué valor resultará en la realización del Test de Apgar?
1. Apgar 7. Moderadamente deprimido.
2. Apgar 8. Deprimido.
3. Apgar 9. Estado satisfactorio.
4. Apgar 9. Moderadamente deprimido.
5. Apgar 12. Estado satisfactorio.

Respuesta correcta: 3. Apgar 9. Estado satisfactorio.